El término A de la ecuación de Van Deemter, conocido como “caminos múltiples”, “difusión en remolino” o “difusión de Eddy”:
1. Aumenta al aumentar el tamaño de partícula de la fase estacionaria.
2. Disminuye al aumentar el tamaño de partícula de la fase estacionaria.
3. Es mayor en las columnas capilares abiertas que en las columnas de relleno.
4. Aumenta al aumentar la velocidad de la fase móvil.
5. Disminuye al aumentar la velocidad de la fase móvil.

Respuesta correcta: 1. Aumenta al aumentar el tamaño de partícula de la fase estacionaria.